Clinical trial exclusion criterion:
Patients with plan to decannulate from ECMO within 48 hours

Entity relations:
- Has_temporal("decannulate from ECMO", "within 48 hours")